Use of oral steroids for no greater than 14 days given for a non-MS condition is not exclusionary.

The above is a clinical trial exclusion criterion. Annotated with entity spans:
[Non-representable: Use of oral steroids for no greater than 14 days given for a non-MS condition is not exclusionary.]